El metal que aparece más frecuentemente en el sitio activo de las metaloproteasas es:
1. Calcio.
2. Magnesio.
3. Selenio.
4. Sodio.
5. Zinc.

Respuesta correcta: 5. Zinc.